一個兩週大的嬰兒，從出生後就常腹脹，便秘；鋇劑灌腸攝影顯現直腸緊縮變窄，到乙狀結腸則慢慢變粗，則最可能的診斷為：
A. 胎糞栓塞症候群（meconium plug syndrome）
B. 巨結腸症（Hirschsprung's disease）
C. 細小左結腸症（small left colon syndrome）
D. 直腸閉鎖症（rectal atresia）

正確答案：B. 巨結腸症（Hirschsprung's disease）